Current significant medical problems that, in the discretion of the investigator, would put the patient at significant risk

The above is a clinical trial exclusion criterion. Annotated with entity spans:
[Non-query-able: Current significant medical problems that, in the discretion of the investigator, would put the patient at significant risk]